at least 6 weeks after surgical sterilization by bilateral tubal ligation or bilateral oophorectomy

The above is a clinical trial inclusion criterion. Annotated with entity spans:
[Temporal: at least 6 weeks] after [Procedure: surgical sterilization] by [Procedure: bilateral tubal ligation] or [Procedure: bilateral oophorectomy]